Clinical trial inclusion criteria:
Adult outpatients (18 years or older)
routinely referred for small bowel video capsule endoscopy (CE)

Annotated entities:
- Person: "Adult"
- Visit: "outpatients"
- Value: "18 years or older"
- Multiplier: "routinely referred"
- Procedure: "small bowel video capsule endoscopy"